Clinical trial inclusion criterion:
Women subjected to ICSI through controlled ovarian hyperstimulation (COH) with pituitary downregulation by GnRHa.

Annotated entities:
- Procedure: "ICSI"
- Person: "Women"
- Procedure: "controlled ovarian hyperstimulation (COH)"
- Procedure: "pituitary downregulation by GnRHa"